Clinical trial exclusion criterion:
Dietary restrictions that would prohibit the consumption of standardized meals

Annotated entities:
- Condition: "Dietary restrictions"
- Qualifier: "would prohibit the consumption of standardized meals"
- Undefined_semantics: "would prohibit the consumption of standardized meals"
- Subjective_judgement: "would prohibit the consumption of standardized meals"